Clinical trial exclusion criterion:
Severe chronic renal failure

Entity relations:
- Has_qualifier("renal failure", "chronic")
- Has_qualifier("renal failure", "Severe")